Clinical trial exclusion criterion:
Hospitalization for major surgery including but not limited to abdominal, thoracic, or cardiovascular surgery within the past 3 months prior to screening, or for a clinically significant non-surgical illness, based on Investigator judgment, within the past 3 months.

Entity relations:
- Has_qualifier("surgery", "major")
- Has_index("within the past 3 months prior to screening", "screening")
- Has_qualifier("non-surgical illness", "clinically significant")
- AND("Hospitalization", "surgery")
- Subsumes("surgery", "abdominal surgery")
- Has_temporal("surgery", "within the past 3 months prior to screening")
- Has_temporal("non-surgical illness", "within the past 3 months")
- OR("abdominal surgery", "cardiovascular surgery", "thoracic surgery")
- OR("Hospitalization", "non-surgical illness")